Prior treatment for wet AMD

The above is a clinical trial exclusion criterion. Annotated with entity spans:
[Temporal: Prior] [Procedure: treatment] for wet AMD